Clinical trial exclusion criterion:
Have other metallic artifacts/components in body that may interact with MRI

Annotated entities:
- Device: "metallic artifacts"
- Device: "metallic components"
- Condition: "interact"
- Procedure: "MRI"